王大明在打籃球接球時不小心，本來應該手掌接球卻變成右手中指接球，頓時手指就腫起來，幾天後消腫手指最後一節就垂下來，怎麼用力都沒辦法伸直。最適當的診斷為何？
A. 板機指（trigger finger）
B. 狹窄性肌腱滑膜炎（de Quervain's tenosynovitis）
C. 鎚狀指（mallet finger）
D. 手部鈕扣畸形（boutonniére deformity）

正確答案：C. 鎚狀指（mallet finger）